Clinical trial inclusion criterion:
Available for ongoing follow-up if required

Annotated entities:
- Post-eligibility: "Available for ongoing follow-up if required"